Clinical trial exclusion criterion:
treatment with an investigational agent for any condition 60 days prior to enrollment.

Annotated entities:
- Competing_trial: "treatment with an investigational agent for any condition 60 days prior to enrollment"